Clinical trial inclusion criterion:
Planned total or near-total thyroidectomy

Entity relations:
- Has_qualifier("thyroidectomy", "total")
- OR("total", "near-total")